Clinical trial inclusion criterion:
Serum creatinine less than or equal to 2.0 mg/dL (Note: Patients with a serum creatinine greater than or equal to 1.4 and less than or equal to 2.0 mg/dL must demonstrate a 24-hour urinary creatinine clearance greater than or equal to 50 mL/min)

Annotated entities:
- Measurement: "Serum creatinine"
- Value: "equal to 2.0 mg/dL"
- Value: "less than"
- Value: "2.0 mg/dL"
- Measurement: "serum creatinine"
- Value: "equal to 1.4 mg/dL"
- Value: "greater than 1.4 mg/dL"
- Value: "less than 2.0 mg/dL"
- Value: "equal to 2.0 mg/dL"
- Measurement: "24-hour urinary creatinine clearance"
- Value: "equal to 50 mL/min"
- Value: "greater than 50 mL/min"